Clinical trial inclusion criterion:
ASA I & II, Nulliparous and Multiparous, Spontaneous/Induced/Augmented Labor, Early active labor (cervix <5 cm (if known)), Pain (VPS) > 3, 18-45 years of age

Entity relations:
- Has_value("ASA", "I & II")
- Has_value("cervix", "<5 cm")
- Has_value("Pain (VPS)", "> 3")
- Has_value("age", "18-45 years")
- Subsumes("Early active labor", "cervix")
- OR("Spontaneous Labor", "Augmented Labor", "Induced Labor")